La atelectasia se produce como consecuencia de:
1. La compresión de los alveolos pulmonares.
2. La dilatación de las vías aéreas.
3. El aumento en la presión hidrostática capilar pulmonar.
4. La inflamación de los bronquios terminales.

Respuesta correcta: 1. La compresión de los alveolos pulmonares.